Clinical trial exclusion criterion:
Patients who are planning to receive mycophenolate instead of everolimus

Annotated entities:
- Mood: "planning to"
- Drug: "mycophenolate"
- Negation: "instead of"
- Drug: "everolimus"